使用個案對照研究（case-control）去探討大腸癌的危險因子，發現在控制各種因子後，時常食用黃豆類的勝算比（OR）是 0.6，其 95%信賴區間是（0.4, 0.9）。由本研究結果，食用黃豆類對大腸癌發生，其作用如何？
A. 沒有作用
B. 傾向有保護作用（protective）
C. 傾向有危害作用（harmful）
D. 由此數據無法確定其作用

正確答案：B. 傾向有保護作用（protective）